治療腎臟結石時，下列何者是選擇使用體外震波碎石、輸尿管鏡或經皮穿腎取石手術的最重要因素？
A. 體型
B. 結石成分
C. 結石大小及數目
D. 結石位置

正確答案：C. 結石大小及數目